一位 7 歲男孩，早上醒來發現右腳小腿非常疼痛，走路跛行。當天下午左腳也有相似的症狀發生，立即住院。神經學檢查發現：兩腳跟腱及膝蓋反射正常且小腿及大腿肌肉張力正常，其血液之 CPK 有異常升高，為正常值上限的十倍。病童已有高燒及上呼吸道感染之症狀 2 天。其最可能發生的疾患是：
A. acute myositis
B. Guillain-Barré syndrome
C. acute myelitis
D. acute rheumatoid arthritis

正確答案：A. acute myositis